Para los fármacos bicompartimentales se cumple que:
1. El volumen aparente de la distribución disminuye con el tiempo desde un valor máximo hasta un valor que se hace constante.
2. El volumen aparente de distribución en función del área es mayor que el volumen aparente de distribución en el estado de equilibrio estacionario.
3. El volumen aparente de distribución es constante en el tiempo.
4. El denominado volumen de distribución inicial es mayor que el volumen aparente de distribución en fase .
5. El volumen aparente de distribución calculado por extrapolación es menor que el volumen aparente de distribución en el estado de equilibrio estacionario.

Respuesta correcta: 2. El volumen aparente de distribución en función del área es mayor que el volumen aparente de distribución en el estado de equilibrio estacionario.